Clinical trial exclusion criterion:
17. Subjects unwilling to use acceptable methods of contraception.

Entity relations:
- Has_qualifier("contraception", "acceptable")
- AND("unwilling", "contraception")